La presión aórtica es mínima durante la fase de:
1. Llenado ventricular lento.
2. Relajación isométrica.
3. Contracción isométrica.
4. Sístole auricular.

Respuesta correcta: 3. Contracción isométrica.